Clinical trial exclusion criterion:
Current acute decompensated heart failure (exacerbation of chronic heart failure manifested by signs and symptoms that may require intravenous therapy).

Annotated entities:
- Qualifier: "acute"
- Qualifier: "decompensated"
- Condition: "heart failure"
- Condition: "exacerbation"
- Condition: "chronic heart failure"
- Procedure: "intravenous therapy"
- Condition: "signs"
- Condition: "symptoms"